¿Cuál de las siguientes determinaciones analíticas es menos útil para la toma de decisiones en el seguimiento y control de una persona infectada por VIH?
1. Recuento de linfocitos CD4 en sangre periférica.
2. Cuantificación de inmunoglobulina.
3. Medición de la carga viral.
4. Estudios de resistencia del VIH a fármacos antirretrovirales.
5. Análisis del tropismo de correceptores.

Respuesta correcta: 2. Cuantificación de inmunoglobulina.